Clinical trial exclusion criterion:
4. Pregnancy within the past 6 months and/or breast-feeding

Annotated entities:
- Condition: "Pregnancy"
- Temporal: "within the past 6 months"
- Condition: "breast-feeding"